Clinical trial exclusion criterion:
health status incompatible with detention in police cells

Annotated entities:
- Observation: "incompatible with detention in police cells"